Clinical trial exclusion criterion:
spine surgery in past

Entity relations:
- Has_temporal("spine surgery", "in past")